Formal H.pylori treatment more than two times

The above is a clinical trial inclusion criterion. Annotated with entity spans:
Formal [Procedure: H.pylori treatment] [Multiplier: more than two times]